Loss of function is expected to be improved by reliable tendon transfer, tenodesis or arthrodesis that is available

The above is a clinical trial exclusion criterion. Annotated with entity spans:
[Observation: Loss of function] is expected to be [Mood: improved by] reliable [Procedure: tendon transfer], [Procedure: tenodesis] or [Procedure: arthrodesis] that is available